Clinical trial inclusion criterion:
Healthy, term, breastfeeding infants who will be predominately breastfed for at least 6-months. This will be determined by answering yes/no to question 'do you intend to breastfeed until your infant is at least 6 months of age.'

Entity relations:
- Has_multiplier("predominately breastfed", "for at least 6-months")